Infection with Plasmodium falciparum or P. vivax either alone or mixed

The above is a clinical trial inclusion criterion. Annotated with entity spans:
[Condition: Infection] with [Qualifier: Plasmodium falciparum] or [Qualifier: P. vivax] either alone or mixed